Unable to understand instructions for using pump in English

The above is a clinical trial exclusion criterion. Annotated with entity spans:
[Post-eligibility: Unable to understand instructions for using pump in English]